Pregnant women with APS diagnosed according to the revised classification criteria for APS in 2006 in Sydney, Australia

The above is a clinical trial inclusion criterion. Annotated with entity spans:
[Condition: Pregnant] [Person: women] with [Condition: APS] diagnosed according to the [Qualifier: revised classification criteria for APS in 2006 in Sydney, Australia]